El músculo aductor mayor:
1. Extiende y aduce la articulación de la cadera.
2. Está inervado por el nervio femoral.
3. Forma la pared anterior del tubérculo aductor.
4. Se inserta en la rama superior del pubis.

Respuesta correcta: 1. Extiende y aduce la articulación de la cadera.